Radiographic signs of osteoarthritis (> Tonis grade 1)

The above is a clinical trial exclusion criterion. Annotated with entity spans:
[Mood: Radiographic signs] of [Condition: osteoarthritis] ([Value: >] [Measurement: Tonis grade] 1)